Clinical trial exclusion criterion:
HIV-infected at screening or enrollment

Entity relations:
- Has_temporal("HIV-infected", "at screening")
- OR("at screening", "at enrollment")